Clinical trial exclusion criterion:
Prior treatment with any anti-TNF agent

Entity relations:
- Has_temporal("treatment", "Prior")
- AND("treatment", "anti-TNF agent")